Clinical trial exclusion criterion:
Life expectancy of less than one year

Annotated entities:
- Observation: "ife expectancy"
- Value: "less than one year"